一位 36 歲女性主訴行動時氣促，理學檢查可聽到固定分裂性第二心音（fixed splitting of second heart sound），在左側第二肋間可聽到收縮期心雜音，心電圖顯示右偏軸，下列何種診斷最有可能？
A. 心室中隔缺損（ventricular septal defect）
B. 心房中隔缺損（atrial septal defect）
C. 開放性動脈導管（patent ductus arteriosus）
D. 主動脈狹窄（coarctation of the aorta）

正確答案：B. 心房中隔缺損（atrial septal defect）